Clinical trial inclusion criterion:
Intrauterine fetal death as confirmed by absence of cardiac motion on ultrasound by Attending physician at the time of admission to the hospital.

Entity relations:
- Has_index("at the time of admission to the hospital", "admission to the hospital")
- AND("ultrasound", "absence of cardiac motion")
- Has_temporal("ultrasound", "at the time of admission to the hospital")